an inability to understand the questionnaires

The above is a clinical trial exclusion criterion. Annotated with entity spans:
an [Observation: inability to understand the questionnaires]